Ulcer infection

The above is a clinical trial exclusion criterion. Annotated with entity spans:
[Condition: Ulcer infection]